Clinical trial inclusion criteria:
Subject has curettage for retained product after second trimester abortion

Annotated entities:
- Procedure: "curettage"
- Procedure: "abortion"
- Qualifier: "second trimester"
- Condition: "retained product"